Diagnosis of functional dyspepsia, based on the Rome IV criteria (2016).

The above is a clinical trial inclusion criterion. Annotated with entity spans:
Diagnosis of [Condition: functional dyspepsia], based on the [Measurement: Rome IV criteria (2016)].